Clinical trial exclusion criterion:
Severe Hypertension Grade 3 WHO classification (Mean Sitting Diastolic Blood Pressure (MSDBP) 110 mmHg and/or Mean Sitting Systolic Blood Pressure MSSBP 180 mmHg)

Annotated entities:
- Condition: "Severe Hypertension"
- Measurement: "Grade WHO classification"
- Value: "3"
- Measurement: "Mean Sitting Diastolic Blood Pressure (MSDBP)"
- Value: "110 mmHg"
- Measurement: "Mean Sitting Systolic Blood Pressure MSSBP"
- Value: "180 mmHg"